一位男童特別高大，主訴關節鬆動、視網膜剝離病變。檢查發現他的第二型膠原蛋白（type II collagen）於三胜肽重複單位（tripeptide repeat）產生突變，以致影響它的四級結構。這個突變最可能發生在那個胺基酸？
A. 羥離胺酸（hydroxylysine）
B. 羥脯胺酸（hydroxyproline）
C. 甘胺酸（glycine）
D. 色胺酸（tryptophan）

正確答案：C. 甘胺酸（glycine）